Clinical trial inclusion criterion:
• Elevated CRP

Entity relations:
- Has_value("CRP", "Elevated")